一個35歲男性患者診斷為malignant lymphoma，diffuse large B-cell type，stage IIA，下列有關敘述何者為正確？
A. 一般而言，積極化學治療約可達到70%的緩解率（remission rate）
B. 除非進行造血幹細胞移植，否則無治癒可能
C. 屬於aggressive malignancy，腫瘤生長速度快，化學藥物治療效果不佳
D. 應該儘可能只給予radiation therapy就好，避免給予systemic chemotherapy，以免以後發生secondary leukemia

正確答案：A. 一般而言，積極化學治療約可達到70%的緩解率（remission rate）